表淺性膀胱癌在診斷時若膀胱內同時有多處大小不一的腫瘤，經尿道切除（transurethral resection）後，若不做膀胱內灌注療法預防再發，則復發率約為多少?
A. 1～2成
B. 3～4成
C. 5～6成
D. 7～8成

正確答案：D. 7～8成